頭部正前方之撞擊，下列何者最易被扯斷而造成矢狀竇旁硬腦膜下出血？
A. 腦膜中動脈及靜脈
B. 大腦上靜脈
C. 淺層大腦中靜脈
D. ）小腦上動脈

正確答案：B. 大腦上靜脈